有關遠端脾腎靜脈分流術（distal splenorenal shunt）之敘述，下列何者錯誤？
A. 遠端脾腎靜脈分流術是將遠端脾靜脈吻合至左腎靜脈，而保有門脈之血流，為選擇性分流術之一種
B. 遠端脾腎靜脈分流術可能會加重腹水之嚴重度，故不適合用於治療食道靜脈曲張合併腹水之病患
C. 門脈下腔靜脈分流術（portacaval shunt）與遠端脾腎靜脈分流術有相似之再出血率（rebleeding rate）
D. 肝硬化合併食道靜脈曲張出血之病患在接受遠端脾腎靜脈分流術後，不適合再接受肝移植手術

正確答案：D. 肝硬化合併食道靜脈曲張出血之病患在接受遠端脾腎靜脈分流術後，不適合再接受肝移植手術